What is Progeria?

Progeria is a rare genetic disorder, characterized by premature aging and early death in the first or second decade of life, usually secondary cardiovascular events (myocardial infarction and stroke).